Clinical trial exclusion criterion:
Severe gastroesophageal reflux disease

Entity relations:
- Has_qualifier("gastroesophageal reflux disease", "Severe")